下列有關胃腸間質瘤（gastrointestinal stromal tumors，GIST）之敘述，何者正確？
A. 發生部位以大腸的比率最高，迴腸其次，胃最少見
B. 約80%的胃腸間質瘤會表現k-ras抗原
C. 約40%的胃腸間質瘤在診斷時已經有淋巴腺轉移
D. 對於轉移或無法手術切除的胃腸間質瘤，使用imatinib mesylate標靶治療的效果良好

正確答案：D. 對於轉移或無法手術切除的胃腸間質瘤，使用imatinib mesylate標靶治療的效果良好